Clinical trial exclusion criterion:
Knowingly affected by HIV or Hepatitis.

Annotated entities:
- Condition: "Hepatitis"
- Condition: "HIV"